關於急性心肌梗塞的典型臨床表現，下列何者錯誤？
A. 通常伴隨著無力、冒汗、噁心、嘔吐
B. 與心絞痛相似，胸痛通常會隨著活動停止而症狀消退
C. 疼痛部位可發生於胸骨劍突下方與上腹部，因此可能被誤診為消化不良
D. 在年老的病人身上，ST 節段上升型心肌梗塞可能表現為突發性呼吸困難，且可能進一步導致肺水腫

正確答案：B. 與心絞痛相似，胸痛通常會隨著活動停止而症狀消退